Clinical trial inclusion criterion:
Patients with body weight = 55 kg and = 140 kg and body mass index (BMI) = 18 kg/m2

Annotated entities:
- Measurement: "body weight"
- Value: "= 55 kg and = 140 kg"
- Measurement: "body mass index (BMI)"
- Value: "= 18 kg/m2"